Clinical trial exclusion criterion:
Women pregnant or lactating.

Annotated entities:
- Person: "Women"
- Condition: "pregnant"
- Condition: "lactating"